Clinical trial exclusion criterion:
12. Severe/untreated blood pressure (systolic 180 mm Hg, diastolic 95 mm Hg).

Entity relations:
- Has_value("systolic", "180 mm Hg")
- Has_value("diastolic", "95 mm Hg")
- Has_qualifier("blood pressure", "Severe")
- Subsumes("Severe", "systolic")
- OR("Severe", "untreated")